大拇指的內收動作（adduction），可作為檢查那一條神經的功能是否完整？
A. 橈神經
B. 正中神經
C. 尺神經
D. 前臂橈神經

正確答案：C. 尺神經